Clinical trial exclusion criterion:
Presence of active infection

Annotated entities:
- Condition: "active infection"